La vinblastina y la vincristina son:
1. Alcaloides indolmonoterpénicos, diméricos con actividad antiarritmíca.
2. Alcaloides derivados de la fenilalanina, monoméricos con actividad arritmíca.
3. Alcaloides indolmonoterpénicos, diméricos con actividad antitumoral.
4. Alcaloides indolmonoterpénicos, monoméricos con actividad antitumoral.
5. Alcaloides derivados de la fenilalanina, diméricos y con actividad antitumoral.

Respuesta correcta: 3. Alcaloides indolmonoterpénicos, diméricos con actividad antitumoral.